La glucosa se metaboliza dentro de la célula beta para estimular la secreción de insulina. ¿Cuál de los siguientes elementos NO interviene en dicho proceso?:
1. Glucoquinasa.
2. Transportador de glucosa (GLUT).
3. Canal de calcio.
4. Enzima limitante de la insulinosecreción.

Respuesta correcta: 4. Enzima limitante de la insulinosecreción.